一位 64 歲女性罹患轉移性乳癌，她已決定接受安寧療護（palliative care）。因慢性的骨頭疼痛而使用非類固醇類止痛藥（NSAID）及 acetaminophen，但效果並不理想。接下來的疼痛控制以下列何者較適當？
A. 給予類固醇如 dexamethasone 控制疼痛後，再給予非類固醇類止痛藥維持症狀之控制
B. 給最低劑量的 fentanyl 貼片
C. 每 4 小時給予 5 mg 的即效型 morphine sulfate，必要時每 2 小時再給一次
D. 給予長效型 morphine sulfate，有 breakthrough pain 時再給予即效型 morphine sulfate

正確答案：C. 每 4 小時給予 5 mg 的即效型 morphine sulfate，必要時每 2 小時再給一次